Clinical trial exclusion criterion:
Patients who have had influenza vaccine in two of the three previous years

Annotated entities:
- Drug: "influenza vaccine"
- Temporal: "in two of the three previous years"